Clinical trial inclusion criterion:
Global myocardial perfusion reserve (MPR) index < 2.5

Entity relations:
- Has_value("Global myocardial perfusion reserve (MPR) index", "< 2.5")